一位患有第一型糖尿病的12歲兒童，因頭暈而被送到醫院。臨床實	診斷有嚴重高血糖、酮酸中毒和血液pH=7.15。必須立即靜脈注射下列何者來控制酮酸中毒的症狀？
A. glyburide
B. tolbutamide
C. insulin glargine
D. crystalline zinc insulin

正確答案：D. crystalline zinc insulin